Clinical trial exclusion criterion:
Clinical diagnosis of Type 1 diabetes, maturity onset diabetes of the young, secondary diabetes or diabetes insipidus.

Annotated entities:
- Condition: "Type 1 diabetes"
- Condition: "maturity onset diabetes of the young"
- Condition: "secondary diabetes"
- Condition: "diabetes insipidus"